Clinical trial exclusion criterion:
Subject has a life expectancy of = 1 year.

Annotated entities:
- Observation: "life expectancy"
- Value: "= 1 year"